Clinical trial exclusion criterion:
Untreated severe comorbid psychiatric or somatic illness.

Annotated entities:
- Condition: "illness psychiatric"
- Condition: "somatic illness"
- Qualifier: "Untreated"
- Qualifier: "severe"
- Qualifier: "comorbid"